Clinical trial exclusion criterion:
Gastric ulcer or duodenal ulcer with clinical manifestations or endoscopically identified acute ulcer without signs of scarring during previous 30 days.

Entity relations:
- AND("duodenal ulcer", "clinical manifestations")
- Has_negation("signs of scarring", "without")
- Has_qualifier("acute ulcer", "endoscopically identified")
- multi("endoscopically identified", "endoscopically")
- AND("acute ulcer", "signs of scarring")
- Has_temporal("acute ulcer", "during previous 30 days")
- OR("Gastric ulcer", "duodenal ulcer", "acute ulcer")